Able to replace their current SABA treatment with study supplied rescue SABA provided at Visit 1 for use as needed for the duration of the study.

The above is a clinical trial inclusion criterion. Annotated with entity spans:
[Subjective_judgement: Able to replace their current SABA treatment with study supplied rescue SABA provided at Visit 1 for use as needed for the duration of the study.]